Clinical trial exclusion criterion:
Has had esophageal or gastric variceal bleeding within the last 6 months

Entity relations:
- Has_temporal("esophageal variceal bleeding", "within the last 6 months")
- OR("esophageal variceal bleeding", "gastric variceal bleeding")